2 歲小孩走路撞到肩膀，大哭、嘴唇發紫而跌在地上、無意識反應。最可能之診斷為何？
A. 外傷性癲癇（traumatic epilepsy）
B. 失神發作（absence attack）
C. 發紺發作（blue spell）
D. 屏氣發作（breath-holding spell）

正確答案：D. 屏氣發作（breath-holding spell）